Las técnicas cognitivas no parecen potenciar el efecto de la exposición en vivo en la mayoría de las fobias específicas, con la posible excepción de:
1. La claustrofobia y la fobia a las alturas.
2. Fobia a la oscuridad.
3. Fobia al agua.
4. Fobia a conducir.
5. Fobia a las serpientes.

Respuesta correcta: 1. La claustrofobia y la fobia a las alturas.